Indique cuál de las siguientes enzimas no requiere molde para sintetizar un ácido nucleico:
1. RNA polimerasa I.
2. RNA polimerasa II.
3. Retrotranscriptasa.
4. Polinucleótido fosforilasa.

Respuesta correcta: 4. Polinucleótido fosforilasa.